Una puntuación típica normalizada igual a cero, deja por debajo de sí:
1. El 0% de los casos.
2. El 50% de los casos.
3. El 100% de los casos.
4. El 25% de los casos.

Respuesta correcta: 2. El 50% de los casos.